普利子蛋白（Prion protein）的感染在人身上造成的疾病是：
A. 狂牛症（Bovine spongiform encephalopathy）
B. 搔羊症（Scrapie）
C. 庫賈氏症（Creutzfeldt-Jakob disease）
D. 阿茲海默症（Alzheimer's disease）

正確答案：C. 庫賈氏症（Creutzfeldt-Jakob disease）